Clinical trial inclusion criterion:
Severe coagulopathy

Entity relations:
- Has_qualifier("coagulopathy", "Severe")